Clinical trial inclusion criterion:
Scheduled for elective Cesarean Delivery

Entity relations:
- Has_qualifier("Cesarean Delivery", "elective")
- Has_mood("Cesarean Delivery", "Scheduled for")